下列何者不會促進胃相期（gastric phase）之胃酸分泌？
A. 胃壁受到食物擴張
B. 消化蛋白質之產物
C. 胰泌素（secretin）分泌增加
D. 刺激迷走神經

正確答案：C. 胰泌素（secretin）分泌增加